Contra-indication to use of GLM (Hypersensitivity to the active substance or to any of the excipients; Active tuberculosis (TB), acute or chronic Hepatitis B infection or other severe infections such as sepsis and/or opportunistic infections including HIV infection; Moderate or severe heart failure (NYHA class III/IV)

The above is a clinical trial exclusion criterion. Annotated with entity spans:
[Condition: Contra-indication] to use of [Drug: GLM] ([Condition: Hypersensitivity] to the [Drug: active substance] or to any of the [Drug: excipients]; [Temporal: Active] [Condition: tuberculosis (TB)], [Qualifier: acute] or [Qualifier: chronic] [Condition: Hepatitis B infection] or other [Condition: severe infections] such as [Condition: sepsis] and/or [Condition: opportunistic infections] including [Condition: HIV infection]; [Qualifier: Moderate] or [Qualifier: severe] [Condition: heart failure] ([Measurement: NYHA] [Value: class III/IV])